Clinical trial exclusion criterion:
Likely source to be from (proven or suspected at the time of randomisation) the central nervous system, e.g. brain abscess, post-surgical meningitis, shunt infection (due to concerns over CNS penetration of piperacillin/tazobactam)

Entity relations:
- Has_qualifier("meningitis", "post-surgical")
- OR("brain abscess", "meningitis", "shunt infection")